Clinical trial inclusion criterion:
Age ≥18 years

Annotated entities:
- Value: "≥18 years"
- Person: "Age"